¿Cómo se denominaban las instituciones dedicadas al cuidado de los enfermos en la iglesia primitiva de Occidente?:
1. Xenodochium.
2. Nosocomio.
3. Valetudinario.
4. Hospicio.

Respuesta correcta: 1. Xenodochium.